¿Qué proceso no está relacionado con un gradiente de protones?:
1. Fosforilación oxidativa.
2. Síntesis de NADPH.
3. Glucolisis.
4. Producción de calor.
5. Transporte activo.

Respuesta correcta: 3. Glucolisis.